Clinical trial exclusion criterion:
3. Known cirrhosis, or >6 standard alcoholic drinks/day

Annotated entities:
- Parsing_Error: "3."
- Condition: "cirrhosis"
- Condition: ">6 standard alcoholic drinks/day"